Lack of sensitization (i.e. PRA < 20%) that would be expected to result in a high likelihood of needing aggressive immunosuppression to treat rejection

The above is a clinical trial inclusion criterion. Annotated with entity spans:
[Negation: Lack of] [Condition: sensitization] (i.e. [Measurement: PRA] [Value: < 20%]) [Non-representable: that would be expected to result in a high likelihood of needing aggressive immunosuppression to treat rejection]